Clinical trial exclusion criterion:
History of blood clotting or bleeding abnormalities

Entity relations:
- Has_temporal("blood clotting", "History")
- OR("blood clotting", "bleeding abnormalities")